Presence or history of relevant hepatic disease as judged by the investigator

The above is a clinical trial exclusion criterion. Annotated with entity spans:
[Parsing_Error: Presence or history] of [Qualifier: relevant] [Condition: hepatic disease] [Subjective_judgement: as judged by the investigator]